Subjects must exhibit willingness, physiologic capability, and an educational level sufficient to comply with all protocol procedures.

The above is a clinical trial inclusion criterion. Annotated with entity spans:
[Post-eligibility: Subjects must exhibit willingness, physiologic capability, and an educational level sufficient to comply with all protocol procedures.]